Clinical trial exclusion criterion:
chronic kidney disease stage IV and V

Annotated entities:
- Condition: "chronic kidney disease"
- Qualifier: "stage IV"
- Qualifier: "stage V"